no pathological HINTS (examination criteria in acute vestibular syndrome)

The above is a clinical trial inclusion criterion. Annotated with entity spans:
[Negation: no] [Qualifier: pathological] [Condition: HINTS] (examination criteria in [Condition: acute vestibular syndrome])